放射碘（radioiodine）治療應施行於分化明確甲狀腺癌（well-differentiated thyroid carcinoma），何者錯誤？
A. 所有III、IV期病人
B. 所有II期45歲以下病人
C. 大部分II期45歲以上病人
D. I期病人

正確答案：D. I期病人